Drug abuse

The above is a clinical trial exclusion criterion. Annotated with entity spans:
[Observation: Drug abuse]